許多新的生物製劑及擬人化的單株抗體已經被發展出來，以治療自體免疫病，但不包括下列那一項？
A. 抗CD20抗體（CD20-specific monoclonal antibody）治療類風濕性關節炎（rheumatoid arthritis）及紅斑性狼瘡（systemic lupus erythematosus）
B. 抗CD3抗體（CD3-specific monoclonal antibody）治療第一型糖尿病（type 1 diabetes mellitus）
C. 抗腫瘤壞死因子抗體（anti-TNF-α antibody）治療類風濕性關節炎
D. 抗DNA helicase抗體（anti-DNA helicase monoclonal antibody）治療紅斑性狼瘡

正確答案：D. 抗DNA helicase抗體（anti-DNA helicase monoclonal antibody）治療紅斑性狼瘡